Clinical trial exclusion criterion:
5. Has a known adverse reaction and/or sensitivity to the study drug or its components.

Annotated entities:
- Parsing_Error: "5."
- Condition: "adverse reaction to the study drug or its components"
- Condition: "sensitivity to the study drug or its components"